Has aphakia, keratoconus or a highly irregular cornea.

The above is a clinical trial exclusion criterion. Annotated with entity spans:
Has [Condition: aphakia], [Condition: keratoconus] or a [Condition: highly irregular cornea].